Clinical trial exclusion criterion:
Lifetime history of Bipolar Disorder, Schizophrenia or Schizoaffective Disorder

Entity relations:
- Has_temporal("Bipolar Disorder", "Lifetime history")
- OR("Bipolar Disorder", "Schizoaffective Disorder", "Schizophrenia")